Adolescent (10-21 years) undergoing spinal fusion for idiopathic scoliosis, spondylolisthesis or Scheuermann kyphosis.

The above is a clinical trial inclusion criterion. Annotated with entity spans:
[Person: Adolescent] ([Value: 10-21 years]) undergoing [Procedure: spinal fusion] for [Condition: idiopathic scoliosis], [Condition: spondylolisthesis] or [Condition: Scheuermann kyphosis].